Clinical trial exclusion criterion:
any wound or infection related to puncture site

Entity relations:
- Has_qualifier("wound", "puncture site")
- OR("wound", "infection")